多環芳香烴（PAH）為空氣中常見污染物，通常以下列那種物質為指標污染物？
A. benz[a]anthracene（BaA）
B. benzo[a]pyrene（BaP）
C. benzo[k]fluoranthene（BkF）
D. benzo[ghi]perylene（BghiP）

正確答案：B. benzo[a]pyrene（BaP）